關於不寧腿症候群（restless leg syndrome），下列何者錯誤？
A. 可能於懷孕期間出現
B. 可能與缺鐵性貧血有關
C. 睡前飲酒有助於緩解不寧腿症候群之症狀
D. Ropinirole（Requip）是一種多巴胺致效劑（dopamine agonist），可用來治療此症

正確答案：C. 睡前飲酒有助於緩解不寧腿症候群之症狀